Clinical trial exclusion criterion:
suspected obstructive choledocholithiasis

Entity relations:
- Has_mood("obstructive choledocholithiasis", "suspected")